List 3 indications for rituximab.

Rituximab  is used to treat rheumatoid arthritis as well as poly- and dermatomyositis, chronic lymphocytic leukemia, juvenile idiopathic arthritis, and Pemphigus foliaceus (PF).